ㄧ位70歲男性病人，主訴為進行性呼吸困難、咳嗽、但痰不多，胸部X光片顯示兩側下肺葉浸潤，HRCT（high-resolution  CT）顯示主要變化為basilar and subpleural reticular opacities，traction bronchiectasis and honeycombing表現，最可能的診斷為：
A. usual interstitial pneumonia（UIP）
B. nonspecific interstitial pneumonia（NSIP）
C. cryptogenic organizing pneumonia
D. aspiration pneumonia

正確答案：A. usual interstitial pneumonia（UIP）